Clinical trial exclusion criterion:
Previous diabetic history, coronary artery disease

Annotated entities:
- Condition: "diabetic"
- Temporal: "history"
- Temporal: "Previous"
- Condition: "coronary artery disease"